下列何者的筋膜構成陰部管（pudendal canal）?
A. 梨狀肌
B. 尾骨肌
C. 提肛肌
D. 閉孔內肌

正確答案：D. 閉孔內肌